Breast implants

The above is a clinical trial exclusion criterion. Annotated with entity spans:
[Device: Breast implants]